Clinical trial exclusion criterion:
Pregnant or breast feeding;

Annotated entities:
- Pregnancy_considerations: "Pregnant or breast feeding"